副交感神經之節前纖維與下列何者伴行？
A. 鼻神經（nasopalatine nerve）
B. 淚神經（lacrimal nerve）
C. 鼓室神經（tympanic nerve）
D. 耳顳神經（auriculotemporal nerve）

正確答案：C. 鼓室神經（tympanic nerve）